子宮輸卵管攝影（HSG）最好在月經週期第幾天進行？
A. 任何一天皆可
B. 第 1~3 天
C. 第 7~11 天
D. 第 14~20 天

正確答案：C. 第 7~11 天